Clinical trial inclusion criterion:
Positive Fortin Finger Test (PMT)

Annotated entities:
- Value: "Positive"
- Measurement: "Fortin Finger Test (PMT)"